Clinical trial exclusion criterion:
With chronic neurological disorders

Annotated entities:
- Condition: "chronic neurological disorders"